Triglycerides > 500 mg/dl with or without use of fibrate;

The above is a clinical trial exclusion criterion. Annotated with entity spans:
[Measurement: Triglycerides] [Value: > 500 mg/dl] with or without use of [Drug: fibrate];